If cirrhosis, Child A score with total bilirubin less than 30 micromoles per liter

The above is a clinical trial inclusion criterion. Annotated with entity spans:
If [Condition: cirrhosis], [Measurement: Child] [Value: A] score with [Measurement: total bilirubin] [Value: less than 30 micromoles per liter]